Clinical trial exclusion criterion:
Dysrhythmia that might pose a risk during exercise or training

Annotated entities:
- Condition: "Dysrhythmia"
- Condition: "pose a risk"
- Temporal: "during exercise"
- Reference_point: "exercise"
- Temporal: "during training"
- Reference_point: "training"